下列那個模式最適合用來解釋「在有可能罹患癌症的高危險群中，為何有些人會去使用癌症篩檢的服務，而有些人卻不會去使用」之行為？
A. 跨理論模式 （the transtheoretical model）
B. 社會行銷 （social marketing）
C. 健康信念模式 （health belief model）
D. 創新擴散理論 （diffusion of innovations）

正確答案：C. 健康信念模式 （health belief model）